下列有關肝細胞癌（hepatocellular carcinoma）之敘述，何者錯誤？
A. 肝細胞癌是最常見的原發性肝惡性腫瘤，好發於東	亞與非洲
B. 肝細胞癌好發於男性，男女比約2 : 1～8 : 1
C. 約有10%肝細胞癌會產生伴腫瘤症候群（paraneoplastic syndrome）， 如高血鈣、低血糖與紅血球增生症
D. 目前已知的治療方式至少包括手術、射頻燒灼（radiofrequency ablation）、酒精注射、經動脈栓塞與標靶治

正確答案：C. 約有10%肝細胞癌會產生伴腫瘤症候群（paraneoplastic syndrome）， 如高血鈣、低血糖與紅血球增生症